Clinical trial exclusion criteria:
NA

Annotated entities:
- Parsing_Error: "NA"